El modelo de fundamentación ética expuesto por Carol Gilligan se denomina Ética:
1. De Máximos.
2. Del Deber.
3. Del Cuidado.
4. De Mínimos.
5. De la Justicia.

Respuesta correcta: 3. Del Cuidado.